Liver enzymes (either AST, ALT, GGPT), or direct bilirubin exceeding 2 x upper limit of normal range

The above is a clinical trial exclusion criterion. Annotated with entity spans:
[Measurement: Liver enzymes] (either [Measurement: AST], [Measurement: ALT], [Measurement: GGPT]), or [Measurement: direct bilirubin] [Value: exceeding 2 x upper limit of normal range]